Clinical trial exclusion criterion:
received antiviral therapy for any systemic anti-viral, anti-neoplastic or immuno-modulatory treatment (including supraphysiologic doses of steroids and radiation) within the past 6 months.

Annotated entities:
- Procedure: "antiviral therapy"
- Drug: "systemic anti-viral"
- Procedure: "anti-neoplastic treatment"
- Procedure: "immuno-modulatory treatment"
- Multiplier: "supraphysiologic doses"
- Drug: "steroids"
- Procedure: "radiation"
- Temporal: "within the past 6 months"